No complications due to other interventions

The above is a clinical trial exclusion criterion. Annotated with entity spans:
[Negation: No] [Condition: complications] due to [Qualifier: other] [Procedure: interventions]